History of colonic mucosal dysplasia or adenomatous colonic polyps that were not removed

The above is a clinical trial exclusion criterion. Annotated with entity spans:
History of [Condition: colonic mucosal dysplasia] or [Condition: adenomatous colonic polyps] that were [Negation: not] [Procedure: removed]